Clinical trial exclusion criterion:
Pulmonary disorders, including COPD and asthma

Annotated entities:
- Condition: "Pulmonary disorders"
- Condition: "COPD"
- Condition: "asthma"